Clinical trial inclusion criteria:
Successful cardiac ablation for AF
Documented freedom from AF recurrence (symptomatic or asymptomatic arrhythmic recurrences lasting longer than 30 seconds) 3 months after successful cardiac ablation (AF recurrence during 3-month blanking period is excluded).
Patient must have been on a commercially approved anticoagulation therapy for at least two (2) months prior to randomization in the OAT Study.
CHADS2 score = 2 or CHA2DS2-VASc score (=3)
Left ventricular ejection fraction > 25%
LA size < 65
High risk for thromboembolic events (i.e., CHADS2 score = 2 or CHA2DS2-VASc score = 3) and require OAT before undergoing cardiac ablation
Able and willing to comply with all pre- and follow-up testing and requirements
Signed informed consent form
Age 18 years or older

Annotated entities:
- Procedure: "cardiac ablation"
- Condition: "AF"
- Qualifier: "Successful"
- Negation: "freedom"
- Condition: "AF recurrence"
- Condition: "arrhythmic recurrences"
- Value: "longer than 30 seconds"
- Temporal: "3 months after successful cardiac ablation"
- Reference_point: "cardiac ablation"
- Non-query-able: "AF recurrence during 3-month blanking period is excluded"
- Drug: "anticoagulation therapy"
- Temporal: "at least two (2) months prior to randomization"
- Reference_point: "randomization"
- Measurement: "CHADS2 score"
- Value: "= 2"
- Measurement: "CHA2DS2-VASc score"
- Value: "=3"
- Measurement: "Left ventricular ejection fraction"
- Value: "> 25%"
- Measurement: "LA size"
- Value: "< 65"
- Observation: "risk for thromboembolic events"
- Value: "High"
- Measurement: "CHADS2 score"
- Value: "= 2"
- Measurement: "CHA2DS2-VASc score"
- Value: "= 3"
- Drug: "OAT"
- Temporal: "before undergoing cardiac ablation"
- Reference_point: "cardiac ablation"
- Post-eligibility: "ble and willing to comply with all pre- and follow-up testing and requirements"
- Informed_consent: "Signed informed consent form"
- Person: "Age"
- Value: "18 years or older"